On stable anti-parkinsonian therapy for 2 weeks before enrollment

The above is a clinical trial inclusion criterion. Annotated with entity spans:
On [Qualifier: stable] [Procedure: anti-parkinsonian therapy] [Multiplier: for 2 weeks] [Temporal: before enrollment]